在人體方面，鉻尚未被證實導致以下何種疾病？
A. 胃癌
B. 肺癌
C. 皮膚炎
D. 鼻中膈穿孔

正確答案：A. 胃癌